有關中樞神經興奮劑cocaine的敘述，下列何者錯誤？
A. 具局部麻醉及血管收縮作用
B. 與海洛因（heroin）會產生交互依賴（cross dependence）的作用
C. 具有阻斷多巴胺（dopamine）再回收系統作用，因此會增加腦中局部多巴胺濃度
D. 具有降低食慾的作用

正確答案：B. 與海洛因（heroin）會產生交互依賴（cross dependence）的作用